Clinical trial inclusion criteria:
Subject's age is between =12 and 16 years, inclusive
Subject is scheduled for a procedure that requires general or neuraxial anesthesia
Subjects must have normal or clinically acceptable physical exam
Subjects with controlled diabetes prior to entry must have a mean systolic/diastolic office blood pressure =128/78 mmHg (sitting, after 5 minutes of rest)
Females must have a urine or serum pregnancy test (Human Chorionic Gonadotropin) that is negative at Screening and Day 1
Subject's parent or legal guardian gives informed consent and subject gives assent.

Annotated entities:
- Person: "age"
- Value: "between =12 and 16 years"
- Context_Error: "="
- Grammar_Error: "inclusive"
- Procedure: "procedure"
- Mood: "scheduled for a procedure"
- Procedure: "neuraxial anesthesia"
- Procedure: "general t"
- Procedure: "physical exam"
- Value: "clinically acceptable"
- Value: "normal"
- Condition: "diabetes"
- Qualifier: "controlled"
- Temporal: "prior to entry"
- Reference_point: "entry"
- Condition: "mean diastolic blood pressure"
- Condition: "mean systolic blood pressure"
- Value: "78 mmHg"
- Value: "128 mmHg"
- Qualifier: "sitting"
- Temporal: "after 5 minutes of rest"
- Reference_point: "rest"
- Measurement: "serum pregnancy test"
- Measurement: "urine pregnancy test"
- Measurement: "Human Chorionic Gonadotropin"
- Value: "negative"
- Temporal: "at Screening"
- Temporal: "Day 1"
- Post-eligibility: "Subject's parent or legal guardian gives informed consent and subject gives assent."